List types of cancer where Long intergenic nonprotein coding RNA p53-induced transcript (LINC-PINT) is involved

Long intergenic nonprotein coding RNA p53-induced transcript (LINC-PINT) has been implicated in various types of cancer such as glioblastoma, breast cancer and pancreatic cancer.